有關阻塞性睡眠呼吸中止症候群（obstructive sleep apnea syndrome；OSAS）之敘述，下列何者錯誤？
A. 大部分合併打鼾（snoring）
B. 嚴重情況會導致肺高壓
C. 清晨睡醒易有頭痛現象，乃因血中二氧化碳濃度降低所致
D. 小孩常見主因為口腔扁桃腺及腺樣體（adenoids）肥大

正確答案：C. 清晨睡醒易有頭痛現象，乃因血中二氧化碳濃度降低所致